Clinical trial inclusion criterion:
Men 18 years or older

Annotated entities:
- Person: "Men"
- Value: "18 years or older"
- Person: "18 years or older"